Healthy patients

The above is a clinical trial inclusion criterion. Annotated with entity spans:
[Condition: Healthy] patients